Men between 45 and 80 years age

The above is a clinical trial inclusion criterion. Annotated with entity spans:
[Person: Men] [Value: between 45 and 80 years] [Person: age]